Estimated intelligence quotient score lower than 70

The above is a clinical trial exclusion criterion. Annotated with entity spans:
[Measurement: Estimated intelligence quotient score] [Value: lower than 70]